Clinical trial exclusion criterion:
Significant liver disease: liver enzymes 2.5 folds the upper normal limit

Entity relations:
- Has_value("liver enzymes", "2.5 folds the upper normal limit")
- Has_qualifier("liver disease", "Significant")
- Subsumes("liver disease", "liver enzymes")